La base de datos donde se recoge el catálogo de genes y enfermedades genéticas humanas hereditarias se denomina:
1. Entrez Gene.
2. EMBL.
3. OMIM.
4. INSDC.

Respuesta correcta: 3. OMIM.